What is the function of emergency granulopoiesis?

The function of granulopoiesis is to increase the number of neutrophils in the bone marrow to fight an infection. It's not a function, it's a function of the immune system.